Clinical trial inclusion criterion:
Body mass index: > 18.5 kg/m2

Entity relations:
- Has_value("Body mass index", "> 18.5 kg/m2")